下列各種氣體在肺泡（alveolus）與肺泡微血管（alveolar capillary）內血液之間進行氣體交換（gas  exchange）時，何者屬於擴散限制性（diffusion-limited）過程？①一氧化二氮（N2O）在正常人體內 ②二氧化碳（CO2）在正常人體內 ③一氧化碳（CO）在正常人體內 ④氧氣（O2）在正常人體內 ⑤氧氣
 （O2）在肺水腫患者（pulmonary edema）體內
A. 僅①②⑤
B. 僅①②④
C. 僅③④⑤
D. 僅③⑤

正確答案：D. 僅③⑤